子宮頸癌多是來自那個部位？
A. 子宮頸陰道部（portio vaginalis）
B. 子宮內頸口（internal os）
C. 子宮內頸（endocervix）
D. 鱗狀柱狀上皮交接處（squamocolumnar junction）

正確答案：D. 鱗狀柱狀上皮交接處（squamocolumnar junction）